Clinical trial exclusion criterion:
use of pain medication prior to procedure

Entity relations:
- Has_temporal("pain medication", "prior to procedure")